下列有關藥物動力學的敘述，何者錯誤？
A. 酸性的藥物在鹼性尿液中較易排出
B. 靜脈注射給藥沒有首渡效應（first-pass effect）
C. 血漿蛋白結合力高的藥物比較不易與其他藥物產生交互作用
D. 血中白蛋白（Albumin）量的改變會影響藥物的代謝

正確答案：C. 血漿蛋白結合力高的藥物比較不易與其他藥物產生交互作用